Contraindication of ALBIS

The above is a clinical trial exclusion criterion. Annotated with entity spans:
[Condition: Contraindication] of [Drug: ALBIS]